Si al añadir una gota de H2O2 a una suspensión bacteriana se generan burbujas (O2), la bacteria produce:
1. Citocromo C oxidasa.
2. Oxigenasa.
3. Superóxido dismutasa.
4. Catalasa.
5. Anhidrasa.

Respuesta correcta: 4. Catalasa.